位於腰大肌（psoas major muscle）內側的腰神經叢分支是：
A. 股神經（femoral nerve）
B. 生殖股神經（genitofemoral nerve）
C. 髂腹股溝神經（iliohypogastric nerve）
D. 閉孔神經（obturator nerve）

正確答案：D. 閉孔神經（obturator nerve）